Which is the effect of the HP1a protein on chromatin?

Heterochromatin Protein 1 (HP1a) is a well-known conserved protein that is involved in heterochromatin formation and gene silencing through the reading of the heterochromatin mark methylation of histone H3 lysine 9 (H3K9me) in different species including humans.